臨床上，對於無症狀的原發性副甲狀腺機能的病患，下列何者不是建議手術的適應症？
A. 血鈣大於 10 mg/dL
B. Creatinine clearance（Ccr）降低超過 30%以上
C. 年紀大於 60 歲
D. 腰椎骨密度明顯降低（t-score < -2.5）

正確答案：C. 年紀大於 60 歲